Clinical trial exclusion criterion:
Participation in an investigational drug or device study within 90 days prior to screening, as calculated from the follow-up from the previous study

Annotated entities:
- Context_Error: "Participation in an investigational drug or device study within 90 days prior to screening, as calculated from the follow-up from the previous study"